Clinical trial exclusion criterion:
Daily use of pain killers

Entity relations:
- Has_multiplier("pain killers", "Daily")